動眼神經（oculomotor nerve）並不支配下列那條眼肌？
A. 內直肌（medial rectus）
B. 外直肌（lateral rectus）
C. 上直肌（superior rectus）
D. 下直肌（inferior rectus）

正確答案：B. 外直肌（lateral rectus）